Radiotherapy within 4 weeks of trial entry.

The above is a clinical trial exclusion criterion. Annotated with entity spans:
[Procedure: Radiotherapy] [Temporal: within 4 weeks of trial entry].